Clinical trial inclusion criterion:
Alanine aminotransferase (ALT) and aspartate aminotransferase (AST) ≤2.5 times the upper limit of normal if no liver involvement or ≤5 times the upper limit of normal with liver involvement.

Annotated entities:
- Measurement: "Alanine aminotransferase (ALT)"
- Measurement: "aspartate aminotransferase (AST)"
- Value: "≤2.5 times the upper limit of normal"
- Condition: "liver involvement"
- Negation: "no"
- Context_Error: "liver involvement"
- Value: "≤5 times the upper limit of normal"
- Condition: "liver involvement."